精子的去獲能作用（decapacitation）在何處進行？
A. 細精管（seminiferous tubule）
B. 副睪管（epididymis）
C. 輸卵管（oviduct）
D. 輸精管（ductus deferens）

正確答案：B. 副睪管（epididymis）